Clinical trial exclusion criterion:
Type 2 diabetes (HbA1c>6.5) or type 1 diabetes

Annotated entities:
- Condition: "Type 2 diabetes"
- Measurement: "HbA1c"
- Value: ">6.5"
- Condition: "type 1 diabetes"